¿Cuál de los siguientes NO se considera factor de riesgo de carcinoma de la vesícula biliar?:
1. Litiasis biliar.
2. Alcoholismo crónico.
3. Vesícula en porcelana.
4. Pólipo vesicular de 15 mm.

Respuesta correcta: 2. Alcoholismo crónico.